下列關於真菌的描述，何者錯誤？
A. 大多數種類的真菌屬於多細胞生物
B. 能引起人類疾病的真菌在真菌中占少數
C. 大多數致病性真菌的繁殖方式是有性生殖
D. 菌絲和孢子可作為鑑別真菌的重要依據

正確答案：C. 大多數致病性真菌的繁殖方式是有性生殖